Clinical trial exclusion criterion:
Recent CVA clinically confirmed (by neurologist) or neuroimaging confirmed stroke or transient ischemic attack (TIA) within 6 months (180 days) of the procedure.

Annotated entities:
- Condition: "CVA"
- Procedure: "neuroimaging"
- Value: "confirmed"
- Condition: "stroke"
- Condition: "transient ischemic attack (TIA)"
- Qualifier: "clinically confirmed (by neurologist)"
- Temporal: "within 6 months (180 days) of the procedure"
- Reference_point: "the procedure"